Clinical trial exclusion criterion:
Very excessive daytime sleepiness (Epworth Sleepiness Scale> 18).

Annotated entities:
- Qualifier: "Very excessive"
- Condition: "daytime sleepiness"
- Measurement: "Epworth Sleepiness Scale"
- Value: "> 18"